下列何者參與形成初始橫膈（primordial diaphragm），在早期胎兒橫膈（early fetal diaphragm）時占大部分，而在新生嬰兒之橫膈（neonate's diaphragm）只佔相當小的部分？
A. 胸腹膜（pleuroperitoneal membrane）
B. 橫中隔（septum transversum）
C. 食道繫膜（mesoesophagus）
D. 原始縱隔（primitive mediastinum）

正確答案：A. 胸腹膜（pleuroperitoneal membrane）